Clinical trial exclusion criterion:
Severe chronic renal failure

Annotated entities:
- Qualifier: "Severe"
- Qualifier: "chronic"
- Condition: "renal failure"